What is the role of TNF in obesity?

The role of TNF in obesity is not fully understood, but it is thought to play a major role in adipose tissue formation and fat storage. TNF-alpha is a protein that has been shown to increase fat storage in fat cells. It also has a role in insulin resistance, which is a major factor in obesity.